What is known about saponins in crops and human consumption?

Saponins are considered antinutrients for humans and have a bitter taste. They should be removed from the crops before consumption.